Progression on or failure to respond to at least one previous chemotherapy regimen for metastatic disease

The above is a clinical trial inclusion criterion. Annotated with entity spans:
[Observation: Progression on] or [Observation: failure to respond] to at least one [Temporal: previous] [Procedure: chemotherapy regimen] for [Condition: metastatic disease]